Clinical trial exclusion criterion:
Significant psychological co-morbidity as assessed subjectively by the investigator

Entity relations:
- Has_qualifier("psychological co-morbidity", "Significant")